Known coagulopathy

The above is a clinical trial exclusion criterion. Annotated with entity spans:
Known [Condition: coagulopathy]